Clinical trial inclusion criterion:
Left ventricular ejection fraction (LVEF) less than 40% by echocardiography during screening and randomization.

Entity relations:
- Has_temporal("echocardiography", "during screening and randomization")
- AND("echocardiography", "Left ventricular ejection fraction (LVEF)")
- Has_value("Left ventricular ejection fraction (LVEF)", "less than 40%")